Septic shock patients despite early goal directed therapy

The above is a clinical trial inclusion criterion. Annotated with entity spans:
[Condition: Septic shock] patients despite [Procedure: early goal directed therapy]